Según Alfaro-Lefevre, el pensar de manera crítica en el contexto de las situaciones enfermeras significa que:
1. Constantemente se está revaluando, autocorrigiendo y buscando mejorar.
2. Sustituye el proceso de atención de enfermería.
3. Apoya propuestas concretas para mantener las prioridades e intervenciones.
4. Hace que pierdan importancia las propias limitaciones y predisposiciones.
5. Proporciona los argumentos para justificar que la mejor respuesta es la perfecta.

Respuesta correcta: 1. Constantemente se está revaluando, autocorrigiendo y buscando mejorar.